Clinical trial inclusion criteria:
For healthy individuals: Healthy, without allergies and with the age of 18 years or above.
For patients: Burn injury exceeding 6-8 Total Burned Surface Area %

Annotated entities:
- Condition: "Healthy"
- Condition: "healthy"
- Negation: "without"
- Condition: "allergies"
- Value: "18 years or above"
- Person: "age"
- Person: "patients"
- Condition: "Burn injury"
- Value: "exceeding 6-8 %"
- Measurement: "Total Burned Surface Area"